Severe neurological disorder leading to immobility or confined to a wheelchair

The above is a clinical trial exclusion criterion. Annotated with entity spans:
[Qualifier: Severe] [Condition: neurological disorder] leading to [Observation: immobility] or confined to a [Device: wheelchair]